previous intolerance to moderate altitude (<2600m).

The above is a clinical trial exclusion criterion. Annotated with entity spans:
previous [Condition: intolerance] to [Qualifier: moderate] [Observation: altitude] ([Value: <2600m]).